Patients who have taken antidepressants or anti-epileptic drugs, sedative hypnotics, selective serotonin reuptake inhibitor, short-acting analgesics, topical medications and anesthetics and/or muscle relaxants when taking Tramadol/Acetaminophen

The above is a clinical trial exclusion criterion. Annotated with entity spans:
Patients who have taken [Drug: antidepressants] or [Drug: anti-epileptic drugs], [Drug: sedative hypnotics], [Drug: selective serotonin reuptake inhibitor], [Drug: short-acting analgesics], [Drug: topical medications] and [Drug: anesthetics] and/or [Drug: muscle relaxants] [Temporal: when taking Tramadol/Acetaminophen]